Age between 18 and 80 years

The above is a clinical trial inclusion criterion. Annotated with entity spans:
[Person: Age] [Value: between 18 and 80 years]